Clinical trial exclusion criterion:
Gastrectomy, biliopancreatic diversion, resection or re-routing of small intestines

Entity relations:
- Has_qualifier("resection", "small intestines")
- OR("resection", "re-routing")
- OR("Gastrectomy", "biliopancreatic diversion", "resection")